Patient who agrees to participate in this study

The above is a clinical trial inclusion criterion. Annotated with entity spans:
[Informed_consent: Patient who agrees to participate in this study]